Diagnosis of posterior circulation ischemic stroke;

The above is a clinical trial inclusion criterion. Annotated with entity spans:
Diagnosis of [Condition: posterior circulation ischemic stroke];